下列那一項是健康促進的基本理念？
A. 民眾應為自己的健康負完全責任
B. 政府應為民眾的健康負完全責任
C. 不同族群在健康上出現不平等是很自然的現象
D. 不同族群在本質上雖有差異，但在健康上仍應平等對待

正確答案：D. 不同族群在本質上雖有差異，但在健康上仍應平等對待